Clinical trial exclusion criterion:
Mentally handicapped.

Annotated entities:
- Condition: "Mentally handicapped"